ASA (American Society of Anesthesiologist) status 1-3 (27)

The above is a clinical trial inclusion criterion. Annotated with entity spans:
[Measurement: ASA] ([Measurement: American Society of Anesthesiologist]) status [Value: 1-3] ([Value: 27])